Clinical trial inclusion criterion:
S. aureus on at least 1 blood culture within 72 hours of beginning study drug (Cohort A) OR

Annotated entities:
- Procedure: "blood culture"
- Multiplier: "at least 1"
- Observation: "S. aureus"
- Temporal: "within 72 hours of beginning study drug"
- Reference_point: "beginning study drug"